3. Ongoing pregnancy.

The above is a clinical trial exclusion criterion. Annotated with entity spans:
[Parsing_Error: 3.] [Temporal: Ongoing] [Condition: pregnancy].